What is the ChIP-exo method used for?

ChIP-exo method for identifying genomic location of DNA-binding proteins with near-single-nucleotide accuracy. ChIP-exo allows identification of a nearly complete set of the binding locations of DNA-binding proteins at near-single-nucleotide resolution with almost no background. Precise Identification of DNA-Binding Proteins Genomic Location by Exonuclease Coupled Chromatin Immunoprecipitation (ChIP-exo).